下列何者不是評估身體功能障礙中日常生活活動（activities of daily living, ADLs）的項目？
A. 洗澡及穿衣
B. 準備食物與打電話
C. 室內走動
D. 進食

正確答案：B. 準備食物與打電話